下列有關氣腫性腎盂腎炎（emphysematous pyelonephritis）的治療原則中，何者是治療初期較少考慮 的？
A. 控制血糖
B. 投予抗生素
C. 經皮引流
D. 立即腎切除

正確答案：D. 立即腎切除